La ribosa-5-fosfato se forma en la ruta de las pentosas fosfato a partir de la:
1. Isomerización de la ribulosa-5-fosfato.
2. Oxidación de la glucosa-6-fosfato.
3. Reacción de la sedoheptulosa-7-fosfato y la eritrosa-4-fosfato.
4. Reacción de la fructosa-6-fosfato y el gliceraldehído-3-fosfato.

Respuesta correcta: 1. Isomerización de la ribulosa-5-fosfato.